Clinical trial inclusion criterion:
Fasting plasma glucose between 200-300 mg/dl (A1C level between 7% and 10%).

Entity relations:
- Has_value("A1C level", "between 7% and 10%")
- Has_value("Fasting plasma glucose", "between 200-300 mg/dl")
- Subsumes("Fasting plasma glucose", "A1C level")